Clinical trial exclusion criterion:
1. Active thromboembolic disease, history of thromboembolic disease (including retinal vein or artery occlusion), known inherited thrombophilia, or family history of thrombosis in a first degree relative

Entity relations:
- Has_temporal("thromboembolic disease", "history")
- Has_temporal("thromboembolic disease", "Active")
- Subsumes("thromboembolic disease", "retinal vein")
- Has_context("thrombosis", "family history")
- Has_context("family history", "in a first degree relative")
- OR("retinal vein", "artery occlusion")
- OR("thromboembolic disease", "thrombosis", "thromboembolic disease", "inherited thrombophilia")